on hemodialysis for less than 3 months

The above is a clinical trial exclusion criterion. Annotated with entity spans:
on [Procedure: hemodialysis] [Temporal: for less than 3 months]